Clinical trial inclusion criterion:
Not in treatment with anti-resorptive agents (like bisphosphonates and denosumab) for more than 4 consecutive years, in order to reduce the risk of medication-related osteonecrosis of the jaws (Lo et al., 2010).

Annotated entities:
- Negation: "Not"
- Drug: "anti-resorptive agents"
- Drug: "bisphosphonates"
- Drug: "denosumab"
- Temporal: "more than 4 consecutive years,"